關於病患知情同意的敘述，下列何者錯誤？
A. 醫師須以病人可以了解的方式提供相關資訊
B. 病患有權在不受生理約束、心理威脅與不當之資訊操控，自由地做出決定
C. 不論係侵入性或非侵入性之醫療行為，病患之同意皆須以書面為之
D. 病人應具有了解相關訊息及其決定可合理預見後果的能力

正確答案：C. 不論係侵入性或非侵入性之醫療行為，病患之同意皆須以書面為之